En la instrucción que realiza la enfermera sobre los cuidados domiciliarios en la diálisis peritoneal, el paciente o cuidador deberá ser capaz de:
1. Mencionar los principios básicos de la técnica aséptica.
2. Analizar las restricciones en la alimentación.
3. Demostrar el procedimiento para agregar medicación a la solución de diálisis.
4. Describir las acciones en caso de urgencia.
5. Todas las respuestas anteriores son correctas.

Respuesta correcta: 5. Todas las respuestas anteriores son correctas.